下列何種 β-adrenoceptor 拮抗劑之排除半衰期（elimination half-life）最短？
A. bisoprolol
B. esmolol
C. nadolol
D. propranolol

正確答案：B. esmolol